Indica cuál de los siguientes trastornos cursará con ictericia:
1. Síndrome de Dubin-Johnson.
2. Síndrome de Zellwerger.
3. Tiroiditis de Hasimoto.
4. Enfermedad de Cushing.
5. Alcaptonuria.

Respuesta correcta: 1. Síndrome de Dubin-Johnson.